Clinical trial exclusion criterion:
Known history of central nervous system damage (i.e. neoplasm, aneurysm, intracranial or spinal surgery) or recent trauma to the head or cranium (i.e. < 3 months)

Annotated entities:
- Condition: "central nervous system damage"
- Condition: "neoplasm"
- Condition: "aneurysm"
- Procedure: "intracranial surgery"
- Procedure: "spinal surgery"
- Condition: "trauma"
- Qualifier: "head"
- Qualifier: "cranium"
- Temporal: "< 3 months"